The Shingrix vaccine is used to prevent what disease?

the shingrix vaccine is used for the prevention of herpes zoster and postherpetic neuralgia.